下列何種吸入性麻醉劑，在固定條件及相同濃度下產生的麻醉效果（potency）最弱？
A. isoflurane
B. desflurane
C. halothane
D. sevoflurane

正確答案：B. desflurane